Subject has sarcoidosis.

The above is a clinical trial exclusion criterion. Annotated with entity spans:
Subject has [Condition: sarcoidosis].